下列那一種抗癲癇藥物對於緩解重積性癲癇（status epilepticus）的效果最佳？
A. ethosuximide
B. diazepam
C. topiramate
D. tiagabine

正確答案：B. diazepam